Clinical trial inclusion criterion:
Age range: 7 to 14 years-old;

Annotated entities:
- Person: "Age"
- Value: "7 to 14 years-old"